Clinical trial inclusion criterion:
ASIA A, B,C and D

Entity relations:
- Has_value("ASIA", "A, B,C and D")